Clinical trial inclusion criterion:
Bilirubin <2.0 mg/dl or SGOT <3.0 X the upper limit of normal.

Entity relations:
- Has_value("SGOT", "<3.0 X the upper limit of normal")
- Has_value("Bilirubin", "<2.0 mg/dl")
- OR("Bilirubin", "SGOT")